Clinical trial inclusion criterion:
Fibromyalgia: by ACR (American College of Rheumatology) 2010 criteria

Entity relations:
- Subsumes("ACR 2010 criteria", "American College of Rheumatology")
- AND("ACR 2010 criteria", "Fibromyalgia")